Clinical trial inclusion criterion:
CRT <U+2267>250µm

Annotated entities:
- Measurement: "CRT"
- Value: "250µm"